子宮頸陰道部的上皮組織屬於下列何者？
A. 分泌黏膜之單層柱狀上皮組織（mucus-secreting simple columnar epithelium）
B. 複層無角質鱗狀上皮組織（stratified nonkeratinized squamous epithelium）
C. 過渡型上皮組織（transitional epithelium）
D. 單層立方上皮組織（simple cuboidal epithelium）

正確答案：B. 複層無角質鱗狀上皮組織（stratified nonkeratinized squamous epithelium）